SPAG5 was implicated in which cancers?

SPAG5 was implicated in prostate cancer, lung cancer and cervical cancer.